Clinical trial exclusion criterion:
Subjects with unresolved infections

Annotated entities:
- Condition: "infections"
- Qualifier: "unresolved"